Clinical trial exclusion criterion:
Patients with impaired cardiac function or clinically significant cardiac diseases.

Annotated entities:
- Condition: "impaired cardiac function"
- Qualifier: "clinically significant"
- Condition: "cardiac diseases"
- Subjective_judgement: "clinically significant"
- Undefined_semantics: "impaired cardiac function"